Clinical trial exclusion criterion:
Subject unwilling to cease use of any treatment for erectile dysfunction during the study, including oral medication, vacuum devices, constrictive devices, injections, urethral suppositories, gels, any over-the-counter or nonprescription medications, and products purchased via the internet

Annotated entities:
- Procedure: "treatment"
- Condition: "erectile dysfunction"
- Temporal: "during the study"
- Procedure: "oral medication"
- Device: "vacuum devices"
- Device: "constrictive devices"
- Procedure: "injections"
- Device: "urethral suppositories"
- Procedure: "gels"
- Qualifier: "over-the-counter"
- Qualifier: "nonprescription"
- Procedure: "medications"
- Negation: "unwilling"
- Mood: "cease use of"